remain intubated in the postoperative period

The above is a clinical trial exclusion criterion. Annotated with entity spans:
remain [Condition: intubated] [Temporal: in the postoperative period]